Clinical trial exclusion criterion:
Poorly controlled hypertension as assessed by the investigator

Annotated entities:
- Condition: "hypertension"
- Qualifier: "Poorly controlled"